Las desacetilasas de histonas (HDAC) promueven:
1. Una cromatina menos condensada.
2. Una unión más débil entre las histonas y el DNA en los nucleosomas.
3. La acetilación de restos lisina en las histonas.
4. Que la cola poli(A) de los RNAs mensajeros de histonas sea más extensa.
5. La terminación de la trascripción y el silenciamiento genético.

Respuesta correcta: 5. La terminación de la trascripción y el silenciamiento genético.